pre-diabetic

The above is a clinical trial inclusion criterion. Annotated with entity spans:
[Condition: pre-diabetic]